What monoclonal antibody drugs are used to treat late stage melanoma?

Dabrafenib, ipilimumab and vemurafenib are monoclonal antibodies that are used to treat late stage melanoma.